Clinical trial inclusion criteria:
Adult patients (18years old or older) undergoing living-donor or deceased-donor liver transplantation

Annotated entities:
- Person: "Adult"
- Value: "18years old or older"
- Person: "years"
- Procedure: "living-donor liver transplantation"
- Procedure: "deceased-donor liver transplantation"